Clinical trial exclusion criterion:
diabetes

Annotated entities:
- Condition: "diabetes"